Clinical trial exclusion criterion:
Serum creatinine > 1.5 x ULN

Annotated entities:
- Measurement: "Serum creatinine"
- Value: "> 1.5 x ULN"